病患於接受手術時常會有低體溫（hypothermia）現象發生，下列有關手術中低體溫現象的敘述，何者錯誤？
A. 於手術麻醉中病患體溫低於 36℃時稱為低體溫
B. 低體溫可以降低氧氣代謝需求量，因此低體溫可於大腦或心臟缺血時提供保護作用
C. 手術中低體溫並不會增加術後的併發症與死亡率
D. 手術中低體溫現象會因病患年齡、腹部手術、長時間手術與室溫過低而更容易發生

正確答案：C. 手術中低體溫並不會增加術後的併發症與死亡率